Clinical trial inclusion criterion:
patients = 70 years of age, undergoing a noncardiac surgical procedure under general anesthesia, with an anticipated duration of postoperative admission of at least 2 days.

Annotated entities:
- Person: "age"
- Value: "= 70 years"
- Procedure: "noncardiac surgical procedure"
- Procedure: "general anesthesia"
- Mood: "anticipated"
- Measurement: "duration of postoperative admission"
- Value: "at least 2 days"
- Procedure: "admission"
- Temporal: "postoperative"